Clinical trial inclusion criterion:
8. Upon pelvic/speculum examination and colposcopy at the time of enrollment, the cervix and vagina appear normal as determined by the investigator

Annotated entities:
- Procedure: "speculum examination"
- Procedure: "pelvic examination"
- Procedure: "colposcopy"
- Temporal: "at the time of enrollment"
- Observation: "vagina"
- Observation: "cervix"
- Value: "normal"
- Qualifier: "normal"
- Subjective_judgement: "as determined by the investigator"